Clinical trial exclusion criterion:
History of spinal cord stenosis or clinical symptoms of lumbar radiculopathy;

Entity relations:
- Has_temporal("spinal cord stenosis", "History")
- AND("clinical symptoms", "lumbar radiculopathy")
- OR("spinal cord stenosis", "clinical symptoms")